欲了解停經後婦女長期服用荷爾蒙補充療法（hormone replacement therapy）對身體各器官系統的影響，以下列何種方式進行研究最適當？
A. 動物模式實
B. 隨機分派試
C. 世代追蹤研究
D. 病例對照研究

正確答案：C. 世代追蹤研究